關於腎小管功能的描述，下列何者錯誤？
A. 經由分泌（secretion）作用，腎小管可以將某物質加到腎絲球過濾液中
B. 經由超過濾（ultrafiltration）作用，腎小管可以將某物質自腎絲球過濾液中回收
C. 因為腎小管不會對菊糖（inulin）進行分泌或回收，所以菊糖的廓清率（clearance）會等於腎絲球過濾率
D. 腎小管對於物質的主動運輸有其上限，即為運輸最大量（transport maximum）

正確答案：B. 經由超過濾（ultrafiltration）作用，腎小管可以將某物質自腎絲球過濾液中回收